Ongoing acute kidney injury Stage 2/3

The above is a clinical trial exclusion criterion. Annotated with entity spans:
Ongoing [Condition: acute kidney injury] [Measurement: Stage] [Value: 2/3]